Clinical trial exclusion criteria:
1. Are unable to understand and sign the consent form
2. Are pregnant or lactating
3. Are physically unable to sit upright and still for 40 minutes
4. Have undergone bilateral mastectomy
5. Are not scheduled to undergo conventional ultrasound

Annotated entities:
- Non-query-able: "Are unable to understand and sign the consent form"
- Post-eligibility: "Are unable to understand and sign the consent form"
- Condition: "pregnant"
- Condition: "lactating"
- Condition: "physically unable to sit upright and still"
- Multiplier: "for 40 minutes"
- Procedure: "bilateral mastectomy"
- Negation: "not"
- Mood: "scheduled"
- Procedure: "conventional ultrasound"